幼兒陰囊水腫的處理原則為何？
A. 應儘快手術，以免睪丸發育不良
B. 應及早手術，因為合併疝氣的機率很高
C. 在一歲以前不必手術，觀察到一歲以後，沒有消失才須手術
D. 一歲以前可用針抽水解除壓力，一歲以後才須手術

正確答案：C. 在一歲以前不必手術，觀察到一歲以後，沒有消失才須手術